Clinical trial inclusion criterion:
Adult patients

Annotated entities:
- Person: "Adult"